Clinical trial inclusion criterion:
AST/ALT: ≤ 2.5 x ULN

Entity relations:
- Has_value("AST/ALT", "≤ 2.5 x ULN")